Anticoagulant use (warfarin or heparin)

The above is a clinical trial exclusion criterion. Annotated with entity spans:
[Drug: Anticoagulant] use ([Drug: warfarin] or [Drug: heparin])